history of vertiginous disease; Ménière, Vertiginous migraine, atypical BPPV

The above is a clinical trial exclusion criterion. Annotated with entity spans:
history of [Condition: vertiginous disease]; [Condition: Ménière], [Condition: Vertiginous migraine], [Condition: atypical BPPV]